Clinical trial exclusion criterion:
use illicit drugs or relapse during the last trimester of pregnancy

Annotated entities:
- Drug: "illicit drugs"
- Condition: "relapse"
- Temporal: "during the last trimester of pregnancy"
- Reference_point: "the last trimester of pregnancy"
- Condition: "pregnancy"
- Qualifier: "last trimester"